一位 45 歲女性因骨盆腔腫瘤住院，經切片檢查，腫瘤組織中發現有多發性巨大細胞（multiple giant cell）、血管纖維組織（vascular fibrous tissue）及血鐵質（hemosiderin）。經診斷為 Brown tumor，請問此症與下列何種疾病有關？
A. 甲狀腺機能低下症（Hypothyroidism）
B. 腦下垂體機能亢進症（Hyperpituitarism）
C. 副甲狀腺機能亢進症（Hyperparathyroidism）
D. Paget's disease

正確答案：C. 副甲狀腺機能亢進症（Hyperparathyroidism）